Latent tuberculosis unless effective anti-tuberculosis therapy has been completed, or active tuberculosis.

The above is a clinical trial exclusion criterion. Annotated with entity spans:
[Condition: Latent tuberculosis] [Negation: unless] effective [Procedure: anti-tuberculosis therapy] has been [Qualifier: completed], or [Condition: active tuberculosis].